Clinical trial exclusion criterion:
Clinically significant active suicidal ideation or self-injurious behavior necessitating immediate treatment, as determined by the investigator.

Entity relations:
- Has_qualifier("treatment", "immediate")
- AND("suicidal ideation", "treatment")
- Has_qualifier("suicidal ideation", "active")
- OR("suicidal ideation", "self-injurious behavior")